¿De qué raíz depende predominantemente la inervación sensitiva del primer dedo del pie?
1. L3.
2. L4.
3. L5.
4. S1.
5. L2.

Respuesta correcta: 3. L5.